Clinical trial exclusion criterion:
Pleural or pericardial effusion greater than 100 ml in volume as documented by appropriate imaging (positron emission tomography [PET], computed tomography [CT] scan or ultrasound). If an effusion greater than 100 ml is documented by cytology to be free from malignancy and the investigator feels the patient is capable of receiving chemo/radiotherapy for their primary disease/ NSCLC, the investigator should discuss the patient with the study physician at Amgen. Effusions smaller than 100 ml would be acceptable, unless the investigator suspects that the effusion is malignant, in which case the effusions should be evaluated by cytology. Sponsor approval must be obtained before patient is randomized.

Entity relations:
- Subsumes("positron emission tomography", "PET")
- Subsumes("computed tomography scan", "CT")
- AND("pericardial effusion", "positron emission tomography")
- Has_value("positron emission tomography", "greater than 100 ml in volume")
- OR("Pleural effusion", "pericardial effusion")
- OR("positron emission tomography", "computed tomography scan", "ultrasound")